有關呼吸困難（dyspnea）之敘述，下列何者錯誤？
A. 焦慮不會引起呼吸困難
B. 呼吸困難是一種主觀上對呼吸不順暢的感覺
C. 呼吸困難的原因甚多，包括心衰竭或呼吸道阻塞
D. 病人的呼吸困難，且伴隨	夜間陣發性呼吸困難（paroxysmal nocturnal dyspnea），其原因可能是心衰竭所致

正確答案：A. 焦慮不會引起呼吸困難